¿Cuál de los siguientes fármacos corresponde al grupo terapéutico de los inhibidores selectivos de la recaptación de serotonina?:
1. Buspirona.
2. Fluoxetina.
3. Zolpidem.
4. Loracepam.
5. Fenitoína.

Respuesta correcta: 2. Fluoxetina.